Clinical trial inclusion criteria:
All patients presenting for elective shoulder arthroscopic procedures will be eligible for enrollment.

Annotated entities:
- Qualifier: "elective"
- Procedure: "shoulder arthroscopic procedures"